生態模式（ecological model）是屬於那一種健康行為改變的模式？
A. 個人層次
B. 人際互動層次
C. 組織團體層次
D. 多層面層次

正確答案：D. 多層面層次